下列關於肥胖的敘述，何者錯誤？
A. 減重是降低血壓的非藥物治療手段之一
B. 成人肥胖與兒童肥胖無關
C. 肥胖與血脂異常、第二型糖尿病、癌症有關
D. 每天減少500至1000大卡，一星期大約可減少0.5～1公斤

正確答案：B. 成人肥胖與兒童肥胖無關